Clinical trial inclusion criterion:
Negative H. pylori test .

Annotated entities:
- Measurement: "H. pylori test"
- Value: "Negative"